一位20歲男性突然發生頸部僵硬的症狀，持續維持在奇怪的姿勢而很難轉動。此患者並無外傷，最近因為胃食道逆流服用metoclopramide藥物治療。此時最好的治療方式是給與下列那一種藥物？
A. phenytoin
B. botulinum toxin
C. benztropine mesylate
D. haloperidol

正確答案：C. benztropine mesylate